Clinical trial exclusion criterion:
Extensive local necrosis or blebs

Entity relations:
- OR("Extensive local necrosis", "Extensive local blebs")